下列何者最不可能誘發肺栓塞（pulmonary embolism）？
A. 病人接受膝關節置換手術
B. 癌症
C. 心臟衰竭
D. 高膽固醇血症

正確答案：D. 高膽固醇血症